呼吸道處置（airway management）的手法中，下列何者被認為是最能夠維持咽喉部軟組織（pharyngeal  soft tissues）氣道開放的單一手法？
A. 張開口部（mouth opening）
B. 甲狀軟骨壓迫術
C. 伸展頭部（head extension）
D. 環狀軟骨壓迫術

正確答案：C. 伸展頭部（head extension）